Clinical trial exclusion criterion:
Subjects with a history of thrombosis or other reason (other than sickle cell disease) for enhanced thrombotic risk

Annotated entities:
- Condition: "thrombosis"
- Condition: "sickle cell disease"
- Condition: "thrombotic risk"
- Mood: "enhanced risk"
- Temporal: "history"
- Negation: "other than"
- Condition: "thrombotic"